Endocrine disorders

The above is a clinical trial exclusion criterion. Annotated with entity spans:
[Condition: Endocrine disorders]